Simple prophylactic cervical cerclage

The above is a clinical trial inclusion criterion. Annotated with entity spans:
[Qualifier: Simple] [Qualifier: prophylactic] [Procedure: cervical cerclage]